Clinical trial exclusion criterion:
Treatment with any other investigational drug within the last three months before Screening

Annotated entities:
- Drug: "investigational drug"
- Procedure: "Treatment"
- Temporal: "within the last three months before Screening"
- Reference_point: "Screening"